有關疾病或狀況篩檢的原則，下列何者不是原則之一？
A. 該疾病或狀況需具有較高的罹病率或死亡率
B. 該疾病或狀況需有較高的盛行率或較高的發生率
C. 該疾病或狀況需具有有症狀的期間，才有足夠時間去檢查
D. 該疾病或狀況必須有廣被接受的治療，且可改善疾病預後

正確答案：C. 該疾病或狀況需具有有症狀的期間，才有足夠時間去檢查